下列有關正黏液病毒（Orthomyxoviridae）及副黏液病毒（Paramyxoviridae）科病毒比較之敘述，何者正確？
A. 兩者都會造成細胞融合（Syncytium）
B. 基因體皆有分段（segmented）
C. 兩者 RNA splicing 皆發生在核內
D. 兩者皆可經由呼吸道傳染

正確答案：D. 兩者皆可經由呼吸道傳染